一名 7 歲男孩在游泳池嬉戲時突發意識不清和休克而給予急救。他的阿姨及舅舅，也因運動時猝死 。下列何者為最可能之診斷？
A. 家族心房抖動（familial atrial fibrillation）
B. 陣發性心室上頻脈（paroxysmal supraventricular tachycardia）
C. Kearns-Sayre 症候群
D. QT 間距延長（long QT）症候群

正確答案：D. QT 間距延長（long QT）症候群